Clinical trial inclusion criterion:
In the opinion of the attending clinician requires dual anti-platelet therapy with aspirin and a P2Y12 receptor antagonist

Entity relations:
- AND("dual anti-platelet therapy", "aspirin")
- AND("dual anti-platelet therapy", "P2Y12 receptor antagonist")
- Has_mood("dual anti-platelet therapy", "requires")